Subjects with known seropositivity to human immunodeficiency virus.

The above is a clinical trial exclusion criterion. Annotated with entity spans:
Subjects with known [Value: seropositivity] to [Measurement: human immunodeficiency virus].